Clinical trial exclusion criterion:
Subject has an active infection either systemic or local.

Annotated entities:
- Condition: "infection"
- Qualifier: "active"
- Qualifier: "systemic"
- Qualifier: "local"